Rheumatoid arthritis

The above is a clinical trial exclusion criterion. Annotated with entity spans:
[Condition: Rheumatoid arthritis]